Clinical trial exclusion criterion:
Any current psychiatric disorder, other than Alcohol Use Disorder, that, in the judgment of the investigator, will require treatment that will interfere with study participation.

Annotated entities:
- Condition: "psychiatric disorder"
- Temporal: "current"
- Condition: "Alcohol Use Disorder"
- Non-representable: "that, in the judgment of the investigator, will require treatment that will interfere with study participation."
- Negation: "other than"